Clinical trial inclusion criterion:
Must be an outpatient with a primary DSM-IV Obsessive-Compulsive Disorder. Patients must have a score of greater than 20 on the Yale-Brown Obsessive Compulsive Scale (Y-BOCS; Goodman et al., 1989b).

Annotated entities:
- Condition: "Obsessive-Compulsive Disorder"
- Qualifier: "primary"
- Qualifier: "DSM-IV"
- Visit: "outpatient"
- Measurement: "Yale-Brown Obsessive Compulsive Scale"
- Value: "score of greater than 20"
- Measurement: "Y-BOCS"